2. Sex: Male and non-pregnant, non-lactating female

The above is a clinical trial inclusion criterion. Annotated with entity spans:
2. Sex: [Person: Male] and [Negation: non]-[Condition: pregnant], [Negation: non]-[Condition: lactating] [Person: female]